HOMA IR< 2.0

The above is a clinical trial exclusion criterion. Annotated with entity spans:
[Measurement: HOMA IR][Value: < 2.0]